Clinical trial inclusion criterion:
Must be an outpatient with a primary DSM-IV Obsessive-Compulsive Disorder. Patients must have a score of greater than 20 on the Yale-Brown Obsessive Compulsive Scale (Y-BOCS; Goodman et al., 1989b).

Entity relations:
- Has_qualifier("Obsessive-Compulsive Disorder", "primary")
- AND("outpatient", "Obsessive-Compulsive Disorder")
- Has_value("Yale-Brown Obsessive Compulsive Scale", "score of greater than 20")
- Subsumes("Yale-Brown Obsessive Compulsive Scale", "Y-BOCS")
- Has_qualifier("Obsessive-Compulsive Disorder", "DSM-IV")